Clinical trial inclusion criterion:
Reduced left ventricular ejection fraction (<50%)

Entity relations:
- Has_value("left ventricular ejection fraction", "Reduced")
- Subsumes("Reduced", "<50%")